Clinical trial exclusion criterion:
Evidence of concomitant infection on exam or gram stain (i.e. herpes, both bacteria and acanthamoeba on gram stain)

Annotated entities:
- Condition: "concomitant infection"